What is the most frequent evolution (next stage) when Aortic intramural hematoma (IMH) is not treated?

Aortic intramural hematoma (IMH) evolves very dynamically in the short-term to regression, dissection, or aortic rupture